下列關於急性心肌梗塞（acute myocardial infarction, AMI）的敘述，何者錯誤？
A. 在 AMI 發生後第一個小時最常見的死因是心臟衰竭
B. Anterior, apical, septal infarction of left ventricle 是由於 left anterior descending artery 的 thrombosis 引起
C. 治療可以給予 morphine, oxygen, aspirin, nitroglycerine
D. AMI 合併重度心臟衰竭時不可以使用β blockers

正確答案：A. 在 AMI 發生後第一個小時最常見的死因是心臟衰竭